一位 70 歲女性病患，因肺癌合併骨轉移以及疼痛，而照會麻醉科求治，病患主訴全身疼痛難耐 （疼痛指數 8/10），目前使用藥物為 acetaminophen 1# tid，下列敘述何者錯誤？
A. 可立即給予嗎啡止痛
B. 可加入抗癲癇藥物幫助止痛
C. 病患自控止痛裝置不適用於癌症病患
D. 脊椎內嗎啡注射為癌症病患止痛方式

正確答案：C. 病患自控止痛裝置不適用於癌症病患